Clinical trial inclusion criterion:
Sensation of incomplete evacuation for =25% of defecations

Entity relations:
- Has_multiplier("defecations", "=25%")
- AND("Sensation of incomplete evacuation", "defecations")